Clinical trial exclusion criterion:
Use of female hormonal products based on estrogen or derivatives

Annotated entities:
- Drug: "female hormonal products"
- Qualifier: "estrogen derivatives"
- Qualifier: "estrogen"